En un estudio epidemiológico se trató de correlacionar el consumo de carne procesada "per cápita" en distintos países en el año 2012 con la incidencia de cáncer de colon registrada en ese mismo año en dichos países. ¿De qué tipo de estudio se trata?
1. Estudio ecológico.
2. Series de casos.
3. Estudio de caso-cohorte.
4. Estudio de corte transversal.

Respuesta correcta: 1. Estudio ecológico.